Age 18-100 years

The above is a clinical trial inclusion criterion. Annotated with entity spans:
[Person: Age] [Value: 18-100 years]